Clinical trial inclusion criterion:
No prior uterine scar

Annotated entities:
- Negation: "No"
- Condition: "uterine scar"